Clinical trial exclusion criteria:
Use of antihistamine within the past 72 hours
Chronic Pulmonary Condition other than asthma
Other contraindication to cetirizine
Severe asthma exacerbation requiring resuscitation

Annotated entities:
- Drug: "antihistamine"
- Temporal: "within the past 72 hours"
- Condition: "Chronic Pulmonary Condition"
- Condition: "asthma"
- Negation: "other"
- Condition: "contraindication"
- Drug: "cetirizine"
- Condition: "asthma exacerbation"
- Procedure: "resuscitation"
- Qualifier: "Severe"